Use of therapeutic or recreational drugs influencing plasmatic coagulation

The above is a clinical trial exclusion criterion. Annotated with entity spans:
[Non-query-able: Use of therapeutic or recreational drugs influencing plasmatic coagulation]